Clinical trial inclusion criterion:
Diastolic blood pressure 60-90 mmHg

Entity relations:
- Has_value("Diastolic blood pressure", "60-90 mmHg")